Clinical trial exclusion criterion:
History of other disease, metabolic dysfunction, physical examination finding, or clinical laboratory finding giving reasonable suspicion of a disease or condition that contraindicates use of an investigational drug or that might affect interpretation of the results of the study or render the patient at high risk for treatment complications

Annotated entities:
- Temporal: "History"
- Qualifier: "other"
- Condition: "disease"
- Condition: "metabolic dysfunction"
- Procedure: "physical examination"
- Condition: "physical examination finding"
- Condition: "clinical laboratory finding"
- Procedure: "clinical laboratory"
- Mood: "suspicion of"
- Condition: "disease"
- Condition: "condition"
- Condition: "contraindicates"
- Drug: "investigational drug"
- Observation: "affect interpretation of the results"
- Observation: "render the patient at high risk"
- Condition: "treatment complications"